Clinical trial inclusion criterion:
Diagnosis of Type 1 diabetes (for at least a year)

Entity relations:
- Has_temporal("Type 1 diabetes", "at least a year")